Interest in future fertility

The above is a clinical trial exclusion criterion. Annotated with entity spans:
[Post-eligibility: Interest in future fertility]